Clinical trial inclusion criterion:
Treated with nasal CPAP modalities = 5 cm H2O and FiO2 between 0.30 and 0.60 for at least 2 hours to maintain SpO2 90-95%;

Annotated entities:
- Measurement: "nasal CPAP"
- Value: "= 5 cm H2O"
- Measurement: "FiO2"
- Value: "between 0.30 and 0.60"
- Temporal: "for at least 2 hours"
- Measurement: "SpO2"
- Value: "90-95%"